抗憂鬱藥物 venlafaxine 對正腎上腺素（norepinephrine）與血清素（serotonin）之藥理作用為何？
A. 正腎上腺素作用大於血清素
B. 血清素作用大於正腎上腺素
C. 正腎上腺素與血清素作用相等
D. 尚未定論

正確答案：B. 血清素作用大於正腎上腺素